陳先生，32 歲，主訴腹瀉 3 天，1 週前曾去泰國觀光。2 天前開始出現腹瀉的症狀，解出來的都是一些黃色稀便或水便，合併有輕微發燒、噁心、腹痛、腹脹及全身倦怠等症狀。他表示，曾經在泰國的路邊攤買一些已削皮、切好的水果來吃，此外也曾在當地自助餐廳吃了一些沙拉和生魚片。曾自 行服用一些胃腸藥，但腹瀉狀況並沒有改善。下列有關此腹瀉病人的敘述何者錯誤？
A. 病原菌以 enterotoxigenic E. coli 最常見
B. 有 20～50%原因不明
C. 早期使用 fluoroquinolone 可縮短病程
D. 建議下次出國時使用抗生素預防

正確答案：D. 建議下次出國時使用抗生素預防